History of major organ transplantation with an existing functional graft.

The above is a clinical trial exclusion criterion. Annotated with entity spans:
History of [Condition: major organ transplantation] with an [Qualifier: existing functional graft].